Clinical trial inclusion criterion:
LVEF <45%

Annotated entities:
- Measurement: "LVEF"
- Value: "<45%"